HBsAg-positive for more than 6 months and HBV DNA < 2000 IU/ml (Subgroup 1)or HBsAg-negative but anti-HBc positive with HBV DNA < 2000 IU/ml (Subgroup 2).

The above is a clinical trial inclusion criterion. Annotated with entity spans:
[Measurement: HBsAg]-[Value: positive] for [Temporal: more than 6 months] and [Measurement: HBV DNA] [Value: < 2000 IU/ml] (Subgroup 1)or [Measurement: HBsAg]-[Value: negative] but [Measurement: anti-HBc] [Value: positive] with [Measurement: HBV DNA] [Value: < 2000 IU/ml] (Subgroup 2).